Which are the main manifestations of Ohdo syndrome?

Severe ID, absent or deficient language, skeletal manifestations including bilateral patella dislocations.